Renal function deficiency (GFR <30 ml/min/1.73m2)

The above is a clinical trial exclusion criterion. Annotated with entity spans:
[Condition: Renal function deficiency] ([Measurement: GFR] [Value: <30 ml/min/1.73m2])